Clinical trial inclusion criterion:
Subject has rapid joint disease, bone absorption, osteopenia, osteomalacia, and/or osteoporosis. Osteoporosis or osteopenia are relative contraindications, since this condition may limit the degree of obtainable correction and/or the amount of mechanical fixation.

Entity relations:
- Has_qualifier("contraindications", "relative")
- Subsumes("osteopenia", "osteopenia")
- Subsumes("osteoporosis", "Osteoporosis")
- AND("osteopenia", "contraindications")
- AND("Osteoporosis", "contraindications")
- OR("rapid joint disease", "osteoporosis", "osteopenia", "bone absorption", "osteomalacia")
- OR("Osteoporosis", "osteopenia")